Clinical trial exclusion criterion:
Has received any licensed or other investigational influenza vaccine within 3 months prior to enrollment in this study or expected receipt of any influenza vaccination before the Day 21 blood collection

Entity relations:
- Has_qualifier("influenza vaccine", "licensed")
- Has_index("within 3 months prior to enrollment in this study", "enrollment in this study")
- Has_index("before the Day 21", "Day 21")
- Has_temporal("influenza vaccine", "within 3 months prior to enrollment in this study")
- Has_context("any influenza vaccination", "expected receipt")
- Has_temporal("any influenza vaccination", "before the Day 21")
- OR("licensed", "other investigational")
- OR("influenza vaccine", "any influenza vaccination")